Clinical trial exclusion criterion:
Allergy to rosuvastatin or parvastatin

Annotated entities:
- Condition: "Allergy"
- Drug: "rosuvastatin"
- Drug: "parvastatin"